一位 1 個月大的男嬰被帶來門診，媽媽主訴男嬰這三天哺餵母乳後立即嘔吐，嘔吐物中無膽汁，過去除了偶爾有輕微稀糊便外，並不曾這樣。下列何者為最適切的診斷？
A. 乳糖不耐症（lactose intolerance）
B. 先天性巨大結腸症（Hirschsprung disease）
C. 肥厚性幽門狹窄症（hypertrophic pyloric stenosis）
D. 十二指腸閉鎖症（duodenal atresia）

正確答案：C. 肥厚性幽門狹窄症（hypertrophic pyloric stenosis）